下列non-steroid anti-inflammatory drugs （NSAIDs）藥物，何者不具有抗發炎作用？
A. acetaminophen
B. etodolac
C. ketoprofen
D. naproxen

正確答案：A. acetaminophen